Gave informed consent

The above is a clinical trial inclusion criterion. Annotated with entity spans:
[Informed_consent: Gave informed consent]